王先生因為病態性肥胖接受胃繞道手術（Roux-en-Y Gastric Bypass），手術後發現用餐後沒多久，就會有腹脹、噁心且伴隨有頭暈、心悸與呼吸不順。有關治療王先生的症狀，下列敘述何者正確？
A. 王先生的症狀與身體分泌 Serotonin 有關，但服用 Serotonin 拮抗劑（Serotonin antagonists）僅能部分改善症狀
B. 飲食習慣應建議王先生少量多餐，並避免蛋白或脂肪類等難消化食物
C. 飲食習慣應建議王先生少量多餐，餐中加湯或飲料，以促進食物消化
D. 王先生的症狀，皮下注射 Sandostatin 可以有效改善胃腸症狀，但對於頭暈、心悸等症狀無效

正確答案：A. 王先生的症狀與身體分泌 Serotonin 有關，但服用 Serotonin 拮抗劑（Serotonin antagonists）僅能部分改善症狀